Herpes viruses have what type of genome?

The genome of Herpes viruses is composed of linear, double-stranded DNA.